Clinical trial exclusion criterion:
systemic disorders such as diabetes, rheumatoid arthritis, haematological diseases (coagulopathy), severe cardiovascular diseases, infections, immunodepression;

Entity relations:
- Has_qualifier("cardiovascular diseases", "severe")
- Subsumes("haematological diseases", "coagulopathy")
- Subsumes("systemic disorders", "diabetes")
- OR("diabetes", "cardiovascular diseases", "immunodepression", "infections", "rheumatoid arthritis", "haematological diseases")